Current diabetes mellitus.

The above is a clinical trial exclusion criterion. Annotated with entity spans:
Current [Condition: diabetes mellitus].